Clinical trial exclusion criterion:
Contraindication to antiplatelet therapy

Annotated entities:
- Condition: "Contraindication"
- Drug: "antiplatelet therapy"